小孩因病毒感染而引起發燒反應，首選退燒藥物應是下列何者？
A. aspirin
B. acetaminophen
C. etodolac
D. celecoxib

正確答案：B. acetaminophen